Clinical trial exclusion criterion:
Participation in any other clinical study within the last 3 months.

Annotated entities:
- Observation: "Participation in clinical study"
- Qualifier: "any other"
- Temporal: "within the last 3 months"